Clinical trial exclusion criterion:
CYP2C8 substrates such as thiazolidinediones (glitazones) and select statins (because of expected inhibition of the metabolism of CYP2C8 substrates) by venetoclax

Annotated entities:
- Drug: "CYP2C8 substrates"
- Undefined_semantics: "CYP2C8 substrates"
- Drug: "thiazolidinediones"
- Drug: "glitazones"
- Drug: "statins"
- Qualifier: "select"